Child-Pugh grade B/C liver failure

The above is a clinical trial exclusion criterion. Annotated with entity spans:
[Measurement: Child-Pugh grade] [Value: B]/[Value: C] [Condition: liver failure]